sexual relationship only with female partners

The above is a clinical trial inclusion criterion. Annotated with entity spans:
[Non-query-able: sexual relationship only with female partners]